moderate to severe Crohn's Disease (basic HBI = 7) with stenosis

The above is a clinical trial inclusion criterion. Annotated with entity spans:
[Qualifier: moderate to severe] [Condition: Crohn's Disease] ([Measurement: basic HBI] [Value: = 7]) with [Condition: stenosis]